Clinical trial exclusion criterion:
Severe gastroesophageal reflux

Annotated entities:
- Condition: "gastroesophageal reflux"
- Qualifier: "Severe"